Ongoing treatment with Beta blockers, Diuretic;

The above is a clinical trial exclusion criterion. Annotated with entity spans:
[Temporal: Ongoing] [Procedure: treatment] with [Drug: Beta blockers], [Drug: Diuretic];